patients with heart, liver, or renal function impairment;presence of severe infections or cerebrovascular disease;

The above is a clinical trial exclusion criterion. Annotated with entity spans:
patients with [Condition: heart], [Condition: liver], or [Condition: renal function impairment];presence of [Qualifier: severe] [Condition: infections] or [Condition: cerebrovascular disease];